Clinical trial exclusion criterion:
Known or suspected gram-negative infections, anaerobic infections, or fungemia

Annotated entities:
- Qualifier: "gram-negative"
- Condition: "infections"
- Condition: "infections"
- Qualifier: "anaerobic"
- Condition: "fungemia"